Preexisting untreated medical condition (thyroid disease, diabetes mellitus, hypertension, pulmonary conditions, cardiac condition…)

The above is a clinical trial exclusion criterion. Annotated with entity spans:
[Qualifier: Preexisting] [Qualifier: untreated] [Condition: medical condition] ([Condition: thyroid disease], [Condition: diabetes mellitus], [Condition: hypertension], [Condition: pulmonary conditions], [Condition: cardiac condition]…)